有關毒殺性T細胞（cytotoxic T lymphocyte，CTL）與自然殺手細胞（natural killer cell， NK）之敘述，何者正確？
A. CTL與NK皆可利用perforin及granzyme分子毒殺標的細胞
B. NK需要辨認MHC class I與專一性抗原才可活化其毒殺機制
C. CTL只需要辨認MHC class I本身即可活化其毒殺機制
D. CTL與NK皆可分化變成記憶性細胞

正確答案：A. CTL與NK皆可利用perforin及granzyme分子毒殺標的細胞